Clinical trial inclusion criterion:
Aspartate transaminase (AST) less than or equal to 5 x ULN

Annotated entities:
- Measurement: "Aspartate transaminase (AST)"
- Value: "less than or equal to 5 x ULN"